Todos los acontecimientos siguientes se producen durante la formación de fosfoenolpiruvato a partir de piruvato EXCEPTO:
1. Se consume CO2.
2. Sale CO2.
3. Se necesita CoA.
4. Se hidroliza ATP.
5. Se hidroliza GTP.

Respuesta correcta: 3. Se necesita CoA.